Clinical trial inclusion criterion:
FRC > 120 % predicted

Annotated entities:
- Measurement: "FRC"
- Value: "> 120 % predicted"